Clinical trial inclusion criterion:
HEALTHY: normal cardiac structure and function on echocardiography, BP < 140/90

Entity relations:
- Has_value("echocardiography", "normal cardiac structure")
- Has_value("BP", "< 140/90")
- AND("HEALTHY", "echocardiography")
- AND("HEALTHY", "BP")
- OR("normal cardiac structure", "normal cardiac function")